Clinical trial inclusion criterion:
If a female of child-bearing potential, must have a negative pregnancy test.

Entity relations:
- AND("pregnancy test", "negative")
- AND("female", "pregnancy test")
- AND("child-bearing potential", "pregnancy test")